比較同一期別的乳癌，下列何種乳癌組織型態預後最好？
A. medullary carcinoma
B. mucinous carcinoma
C. metaplastic carcinoma
D. infiltrating ductal carcinoma

正確答案：B. mucinous carcinoma